一位老太太因為骨質疏鬆症而有第十胸椎的壓迫性骨折（T10 compression fracture），則下列那一種背架最為合適？
A. 奈特－泰勒氏（Knight-Taylor）背架
B. 威廉氏（William）背架
C. 奈特氏（Knight）背架
D. 密爾瓦基（Milwaukee）背架

正確答案：A. 奈特－泰勒氏（Knight-Taylor）背架